Clinical trial exclusion criterion:
Women of childbearing potential who are or might be pregnant at the time of study enrollment (method of assessment upon physician discretion)

Entity relations:
- Has_temporal("pregnant", "at the time of study enrollment")
- Has_context("pregnant", "are or might be")
- AND("childbearing potential", "pregnant")
- AND("Women", "pregnant")